Clinical trial exclusion criteria:
Current or planned pregnancy
History of neuropathic pain, chronic pain syndrome, or preoperative use of narcotic or neuropathic pain medicine
Radiographic signs of osteoarthritis (> Tonis grade 1)
Inability to attend follow up visits
Documented allergy to local anesthetic

Annotated entities:
- Temporal: "Current"
- Mood: "planned"
- Condition: "pregnancy"
- Condition: "neuropathic pain"
- Temporal: "History"
- Condition: "chronic pain syndrome"
- Temporal: "preoperative"
- Drug: "narcotic medicine"
- Drug: "neuropathic pain medicine"
- Mood: "Radiographic signs"
- Procedure: "Radiographic"
- Condition: "osteoarthritis"
- Measurement: "Tonis grade"
- Value: "> 1"
- Condition: "Inability"
- Observation: "attend follow up visits"
- Condition: "allergy"
- Drug: "local anesthetic"